Clinical trial inclusion criterion:
Liver function: transaminase=2.5× upper limit of normal value,bilirubin=1.5×upper limit of normal value;

Annotated entities:
- Measurement: "transaminase"
- Value: "=2.5× upper limit of normal value"
- Measurement: "bilirubin"
- Value: "=1.5×upper limit of normal value"